Subjects with documented physician diagnosis of asthma as their primary respiratory disease.

The above is a clinical trial inclusion criterion. Annotated with entity spans:
Subjects with documented physician diagnosis of [Condition: asthma] as their [Qualifier: primary respiratory disease].